Clinical trial inclusion criterion:
Indication of kidney transplantation

Annotated entities:
- Procedure: "kidney transplantation"
- Mood: "Indication"